Clinical trial exclusion criterion:
LV ejection fraction < 50%.

Entity relations:
- Has_value("LV ejection fraction", "< 50%")